Clinical trial exclusion criteria:
1. Prior Therapy Exposure to chemotherapy or radiotherapy within 2 weeks prior to entering the study or those who have not recovered from adverse events due to agents administered more than 2 weeks earlier. Systemic steroids that have not been stabilized (≥ 5 days) to the equivalent of ≤10 mg/day prednisone prior to the start of the study drugs. No other investigational agents are allowed.
2. History of allergic reactions to TGR-1202 or carfilzomib
3. Uncontrolled inter-current illness
4. Pregnant women
5. Nursing women
6. Current malignancy or history of a prior malignancy
7. Patient known to be Human Immunodeficiency Virus (HIV)-positive
8. Active Hepatitis A, Hepatitis B, or Hepatitis C infection

Annotated entities:
- Parsing_Error: "1."
- Temporal: "Prior"
- Procedure: "chemotherapy"
- Procedure: "radiotherapy"
- Temporal: "within 2 weeks prior"
- Reference_point: "entering the study"
- Condition: "recovered"
- Negation: "not"
- Condition: "adverse events"
- c-Requires_causality: "due to"
- Drug: "agents"
- Temporal: "more than 2 weeks earlier"
- Drug: "Systemic steroids"
- Qualifier: "stabilized"
- Negation: "not"
- Temporal: "≥ 5 days"
- Multiplier: "≤10 mg/day"
- Drug: "prednisone"
- Temporal: "prior to"
- Reference_point: "start of the study drugs"
- Drug: "other investigational agents"
- Grammar_Error: "No other investigational agents are allowed"
- Context_Error: "other investigational agents"
- Parsing_Error: "2."
- Condition: "allergic reactions"
- Drug: "TGR-1202"
- Drug: "carfilzomib"
- Temporal: "History"
- Parsing_Error: "3."
- Condition: "inter-current illness"
- Qualifier: "Uncontrolled"
- Undefined_semantics: "Uncontrolled inter-current illness"
- Temporal: "inter-current"
- Parsing_Error: "4."
- Person: "women"
- Condition: "Pregnant"
- Parsing_Error: "5."
- Person: "women"
- Condition: "Nursing"
- Parsing_Error: "6."
- Condition: "malignancy"
- Temporal: "Current"
- Condition: "malignancy"
- Temporal: "history of a prior"
- Parsing_Error: "7."
- Measurement: "Human Immunodeficiency Virus (HIV)"
- Value: "positive"
- Parsing_Error: "8."
- Condition: "Hepatitis A"
- Condition: "Hepatitis B"
- Condition: "Hepatitis C"